Can do questionnaires

The above is a clinical trial inclusion criterion. Annotated with entity spans:
[Observation: Can do questionnaires]